下列何菌之細胞壁有 protein A 的結構，可與 IgG 結合？
A. A 族溶血鏈球菌（Group A hemolytic streptococcus）
B. 肺炎雙球菌（Streptococcus pneumoniae）
C. 金黃色葡萄球菌（Staphylococcus aureus）
D. 淋病雙球菌（Neisseria gonorrhoeae）

正確答案：C. 金黃色葡萄球菌（Staphylococcus aureus）